Functioning telephone

The above is a clinical trial inclusion criterion. Annotated with entity spans:
[Non-query-able: Functioning telephone]